Clinical trial exclusion criterion:
4. A woman who is pregnant, nursing an infant, or planning a pregnancy.

Annotated entities:
- Parsing_Error: "4."
- Person: "woman"
- Condition: "pregnant"
- Condition: "nursing"
- Non-query-able: "planning"
- Condition: "pregnancy"